下列有關散光（astigmatism）的敘述，何者錯誤？
A. 視力表上的日晷形放射狀圖，是專為檢查散光用的
B. 角膜弧度計測出的角膜散光值，可作為眼球散光的參考
C. 散光可藉柱鏡（cylinder）來矯正其屈光誤差（refractive errors）
D. 柱鏡（cylindric lens）之軸度（axis），是指散光度數所在的方向（meridian）

正確答案：D. 柱鏡（cylindric lens）之軸度（axis），是指散光度數所在的方向（meridian）